人類的DNA（genome）分別包裹於各條染色體之中，人類大約有兩萬三千個基因。下列有關基因在染色體上分布之敘述，何者錯誤？
A. 染色體的中心節或端粒（telomere）處常有許多重複的序列
B. 基因（gene）常由多個exon所組成，exon和exon之間的intron常常比exon要長的多
C. 人類的基因排列相當的緊密，基因和基因之間幾乎沒有甚麼無關的序列，這和低等生物不
D. 人類的DNA上有一些小段的序列，雖然沒有負責蛋白質，但是會轉錄形成shRNA，可能有基因調控的功能

正確答案：C. 人類的基因排列相當的緊密，基因和基因之間幾乎沒有甚麼無關的序列，這和低等生物不